La anemia por deficiencia de hierro se trata con preparados orales o parenterales del mismo:
1. Por vía oral sólo deben utilizarse sales ferrosas.
2. Por vía oral sólo deben utilizarse sales férricas.
3. Por vía oral la forma más adecuada es el complejo hierro-dextrano.
4. Por vía oral el tratamiento debe durar como máximo quince días.
5. Por vía parenteral sólo deben usarse sales ferrosas.

Respuesta correcta: 1. Por vía oral sólo deben utilizarse sales ferrosas.